Concurrent prescription of medicines for ADHD or medicines that significantly could affect test performance.

The above is a clinical trial exclusion criterion. Annotated with entity spans:
Concurrent prescription of [Drug: medicines] for [Condition: ADHD] or medicines that significantly could affect test performance.